What illness is transmitted by the Lone Star Tick, Amblyomma americanum?

Today,A americanumremains an important vector for tick-borne illness. In addition to others, species ofRickettsia,Ehrlichia, andBorreliaare all transmitted by the lone star tick.  It transmits several human pathogens, including the agents of human monocytic ehrlichiosis, tularemia, and southern tick-associated rash illness.